10 個月大的健康男嬰，突然發生間歇性腹痛、嘔吐，並解出含有黏液血便，右腹部摸到香腸狀腫塊 （sausage mass）應首選安排什麼檢查確定診斷？
A. 腹部超音波（abdominal sonography）
B. 鋇劑上消化道檢查（upper GI study）
C. 胃鏡（endoscopy）
D. 腹部核醫檢查（Tc-99m pertechnetate scintigraphy）

正確答案：A. 腹部超音波（abdominal sonography）